Clinical trial exclusion criterion:
A life expectancy (assessed by investigator) of less than 6 months or is no longer capable of taking medication orally.

Entity relations:
- Has_value("life expectancy", "less than 6 months")